Clinical trial exclusion criterion:
12. Any serious acute, chronic or progressive disease

Entity relations:
- Has_qualifier("disease", "serious")
- OR("serious", "chronic", "acute", "progressive")